Life expectancy >12 weeks

The above is a clinical trial inclusion criterion. Annotated with entity spans:
[Observation: Life expectancy] [Value: >12 weeks]